Clinical trial exclusion criterion:
Primary diagnosis for current hospitalization is unrelated to worsening lower respiratory symptoms (e.g., pulmonary clean out, distal intestinal obstruction syndrome (DIOS), sinusitis)

Entity relations:
- Has_context("Primary diagnosis", "current hospitalization")
- Has_qualifier("lower respiratory symptoms", "worsening")
- Subsumes("distal intestinal obstruction syndrome", "DIOS")
- Subsumes("lower respiratory symptoms", "pulmonary clean out")
- NOT("unrelated", "lower respiratory symptoms")
- OR("pulmonary clean out", "distal intestinal obstruction syndrome", "sinusitis")